Any unstable systematic disease (including active infection, uncontrolled high blood pressure, unstable angina, onset of angina within the last 3 months, congestive heart failure, myocardial infarction within the previous 12 months, severe arrhythmia needing drug treatment, liver, kidney or metabolic disease)

The above is a clinical trial exclusion criterion. Annotated with entity spans:
Any [Qualifier: unstable] [Condition: systematic disease] (including active [Condition: infection], [Qualifier: uncontrolled] [Condition: high blood pressure], [Condition: unstable angina], [Measurement: onset] of [Condition: angina] [Temporal: within the last 3 months], [Condition: congestive heart failure], [Condition: myocardial infarction] [Temporal: within the previous 12 months], [Qualifier: severe] [Condition: arrhythmia] needing [Drug: drug] [Procedure: treatment], [Condition: liver], [Condition: kidney] or [Condition: metabolic disease])